Clinical trial inclusion criterion:
Tumor equal or below 10 cm from the anal verge, candidates to (ETM) low anterior resection and anastomosis, with or without preoperative chemo-radiotherapy.

Entity relations:
- Has_mood("low anterior resection", "candidates")
- Has_temporal("chemo-radiotherapy", "preoperative")
- Has_qualifier("Tumor", "equal or below 10 cm from the anal verge")
- OR("low anterior resection", "low anterior anastomosis")